Presenta gametocitos en forma de media luna:
1. Plasmodium falciparum.
2. Plasmodium vivax.
3. Plasmodium ovale.
4. Plasmodium malariae.

Respuesta correcta: 1. Plasmodium falciparum.